Clinical trial inclusion criterion:
Cared for in the pediatric intensive care unit or pediatric cardiac intensive care unit

Entity relations:
- OR("pediatric intensive care unit", "pediatric cardiac intensive care unit")